Clinical trial exclusion criterion:
History of nephrolithiasis

Entity relations:
- Has_temporal("nephrolithiasis", "History")